Clinical trial exclusion criterion:
Pregnant or nursing women.

Entity relations:
- OR("Pregnant", "nursing")